Asthma and allergy to aspirin, ibuprofen or any other nonsteroidal antiinflammatory drug;

The above is a clinical trial exclusion criterion. Annotated with entity spans:
[Condition: Asthma] and [Condition: allergy] to [Drug: aspirin], [Drug: ibuprofen] or [Qualifier: any other] [Drug: nonsteroidal antiinflammatory drug];